Clinical trial exclusion criterion:
Post-traumatic or post surgery of lower extremity

Annotated entities:
- Temporal: "Post-traumatic of lower extremity"
- Temporal: "post surgery of lower extremity"